Clinical trial exclusion criterion:
Electroconvulsive therapy in last 6 months

Entity relations:
- Has_temporal("Electroconvulsive therapy", "in last 6 months")